Clinical trial exclusion criterion:
Use of any of the following medications within two weeks of randomization: MAO inhibitors, Calcium channel blockers, alpha blockers, beta blockers, disopyramide, flecainide, encainide, moricizine, propafenone, sotalol, or beta adrenergic agonists

Annotated entities:
- Temporal: "within two weeks of randomization"
- Drug: "MAO inhibitors"
- Drug: "Calcium channel blockers"
- Drug: "alpha blockers"
- Drug: "beta blockers"
- Drug: "disopyramide"
- Drug: "flecainide"
- Drug: "encainide"
- Drug: "moricizine"
- Drug: "propafenone"
- Drug: "sotalol"
- Drug: "beta adrenergic agonists"